Esophagectomy

The above is a clinical trial inclusion criterion. Annotated with entity spans:
[Procedure: Esophagectomy]